Clinical trial exclusion criterion:
History of craniectomy or significant skull defect (contraindication to Optune).

Entity relations:
- Has_qualifier("skull defect", "significant")
- AND("contraindication", "Optune")
- OR("craniectomy", "skull defect")